Clinical trial inclusion criterion:
The patient underwent a successful transcutaneous implant procedure for an aortic valve within the past 24 hours

Annotated entities:
- Procedure: "transcutaneous implant procedure"
- Device: "aortic valve"
- Temporal: "past 24 hours"